下列關於薑片蟲（Fasciolopsis buski）的敘述，何者正確？
A. 為寄生在人體肝臟的巨大吸蟲
B. 因食入淡水魚中的囊狀幼蟲（metacercaria）感染
C. 嚴重感染時可能發生水腫和腹水現象
D. 可以用「免疫診斷」來確認診斷

正確答案：C. 嚴重感染時可能發生水腫和腹水現象